Clinical trial exclusion criterion:
Inborn errors of metabolism that need protocol-determined fluid therapy

Entity relations:
- Has_qualifier("fluid therapy", "protocol-determined")
- Has_mood("fluid therapy", "need")
- AND("Inborn errors of metabolism", "fluid therapy")